La espectrometría de masas se combina con la cromatografía para generar una herramienta analítica muy poderosa. En lo que se refiere a la espectrometría de masas (MS), se puede decir que:
1. La ionización electrónica se basa en las reacciones ion-molécula entre los iones de gas reactivo y las moléculas de analito.
2. El analizador de masas de cuadrupolo lineal consiste en cuatro cilindros que se colocan en paralelo de forma que se cargan positiva y negativamente de forma alternativa.
3. El analizador de tiempo de vuelo se basa en un tubo de material altamente cargado de forma que solo entran y se separan los iones de carga contraria.
4. La trampa de iones puede colocarse al final de la columna cromatográfica para iones moleculares a partir de los analitos ya separados e impactar en la pantalla de un detector radiactivo.
5. El método de ionización conocido como MALDI se basa en la desorción de iones de una matriz en forma de gel por bombardeo rápido de gas supercrítico.

Respuesta correcta: 2. El analizador de masas de cuadrupolo lineal consiste en cuatro cilindros que se colocan en paralelo de forma que se cargan positiva y negativamente de forma alternativa.